Clinical trial inclusion criterion:
Subject is 65 years old who is able and willing to give an informed consent.

Entity relations:
- Has_value("old", "65 years")